針對青少年處於不同階段，而採取不同步驟與策略協助其戒菸，例如若吸菸者缺乏戒菸意願，應教導吸菸害處以強化戒菸動機，若吸菸者打算近期內戒菸，可提供其戒菸計畫與方法，這是應用那一種理論或模式來改 變行為？
A. 社會學習理論
B. 健康信念模式
C. 操作性制約理論
D. 跨理論模式

正確答案：D. 跨理論模式